Clinical trial exclusion criterion:
Current use of Thioridazine

Annotated entities:
- Drug: "Thioridazine"